Clinical trial exclusion criterion:
Patients with a life expectancy of less than 1 year

Entity relations:
- Has_value("life expectancy", "less than 1 year")